Clinical trial exclusion criteria:
1. bilateral AT
2. insertional AT
3. local steroid injection within 6 weeks or physical therapy within 4 weeks
4. inability to comply with follow-up criteria
5. history of surgery on the Achilles tendon or systemic diseases (general inflammatory diseases such as rheumatologic disorders and diabetes)
6. daily use of opioids for pain
7. anticoagulation or immunosuppressive therapy
8. intent to use NSAIDs or steroids
9. self-reported pregnancy

Annotated entities:
- Condition: "bilateral AT"
- Condition: "insertional AT"
- Procedure: "local steroid injection"
- Temporal: "within 6 weeks"
- Procedure: "physical therapy"
- Temporal: "within 4 weeks"
- Post-eligibility: "inability to comply with follow-up criteria"
- Subjective_judgement: "inability to comply with follow-up criteria"
- Non-query-able: "inability to comply with follow-up criteria"
- Temporal: "history"
- Procedure: "surgery on the Achilles tendon"
- Condition: "systemic diseases"
- Condition: "general inflammatory diseases"
- Condition: "rheumatologic disorders"
- Condition: "diabetes"
- Drug: "opioids"
- Condition: "pain"
- Multiplier: "daily"
- Procedure: "anticoagulation therapy"
- Procedure: "immunosuppressive therapy"
- Drug: "NSAIDs"
- Drug: "steroids"
- Condition: "pregnancy"